Clinical trial exclusion criterion:
End of last exacerbation less than 6 weeks prior to screening/re-screening visit.

Annotated entities:
- Condition: "exacerbation"
- Temporal: "less than 6 weeks prior to screening/re-screening visit"
- Reference_point: "screening/re-screening visit"